Minimum of 24 permanent teeth.

The above is a clinical trial inclusion criterion. Annotated with entity spans:
[Multiplier: Minimum of 24] [Observation: permanent teeth].